American Society of Anesthesiologists Classification I-III

The above is a clinical trial inclusion criterion. Annotated with entity spans:
[Observation: American Society of Anesthesiologists Classification] [Value: I-III]